我國全民健保為控制醫療費用過度成長，陸續推出了多項論病例計酬（case payment）制度，這種制度屬於何種支付制度？
A. 前瞻性支付制度（prospective payment system）
B. 回溯性支付制度（retrospective payment system）
C. 立即性支付制度
D. 實支實付型支付制度

正確答案：A. 前瞻性支付制度（prospective payment system）